En un ELISA (“Enzyme-Linked ImmunoSorbent Assay”) indirecto:
1. El antígeno ha de estar desnaturalizado previamente.
2. Se pueden cuantificar anticuerpos específicos.
3. El antígeno queda “emparedado” entre dos preparaciones de anticuerpos.
4. El anticuerpo específico para el antígeno está conjugado a un enzima.
5. Se cuantifican antígenos en solución.

Respuesta correcta: 2. Se pueden cuantificar anticuerpos específicos.